6. Known history of alpha-1-Antitrypsin deficiency

The above is a clinical trial exclusion criterion. Annotated with entity spans:
[Parsing_Error: 6.] Known [Temporal: history] of [Condition: alpha-1-Antitrypsin deficiency]